16. Written informed consent must be provided.

The above is a clinical trial inclusion criterion. Annotated with entity spans:
16. [Post-eligibility: Written informed consent must be provided.]